會引起胰臟炎的原因包括有下列數種，何者是最常見會引起急性胰臟炎的原因？
A. 膽道結石
B. 酗酒
C. 高血鈣
D. 內視鏡逆行性膽道胰管攝影後

正確答案：A. 膽道結石